Clinical trial inclusion criteria:
Liver Transplant Recipients have received liver transplantations for at least 6+1 months prior to enrollment
Liver Transplant Recipients have no acute rejection episodes within 3 months prior to the enrollment and are clinically stable
Liver Transplant Recipients have been treated with twice-daily regimen of tacrolimus(TAC) plus everolimus(EVR) and TAC and EVR trough levels have stayed within targeted ranges for at least 6 weeks prior to enrollment
Provide written informed consent prior to inclusion.
Liver transplant recipients who are 18-65 years of age of a primary liver transplant
Allograft functioning at an acceptable level as defined by the AST, ALT, Total Bilirubin levels =3 times ULN prior to enrollment.
Abbreviated MDRD eGFR = 30 mL/min/1.73m2.

Annotated entities:
- Person: "Liver Transplant Recipients"
- Procedure: "liver transplantations"
- Temporal: "for at least 6+1 months prior to enrollment"
- Reference_point: "enrollment"
- Person: "Liver Transplant Recipients"
- Negation: "no"
- Qualifier: "acute"
- Condition: "rejection episodes"
- Temporal: "within 3 months prior to the enrollment"
- Reference_point: "the enrollment"
- Condition: "clinically stable"
- Person: "Liver Transplant Recipients"
- Multiplier: "twice-daily"
- Drug: "tacrolimus(TAC)"
- Drug: "everolimus(EVR)"
- Measurement: "TAC trough levels"
- Measurement: "EVR trough levels"
- Value: "within targeted ranges"
- Temporal: "for at least 6 weeks prior to enrollment"
- Reference_point: "enrollment"
- Observation: "written informed consent"
- Temporal: "prior to inclusion"
- Reference_point: "inclusion"
- Person: "Liver transplant recipients"
- Person: "age"
- Value: "18-65 years"
- Procedure: "primary liver transplant"
- Measurement: "Allograft functioning"
- Value: "acceptable level"
- Measurement: "AST"
- Measurement: "ALT"
- Measurement: "Total Bilirubin"
- Value: "=3 times ULN"
- Temporal: "prior to enrollment"
- Measurement: "MDRD eGFR"
- Value: "= 30 mL/min/1.73m2"